La expresión simultánea de IgM e IgD se observa por primera vez en linfocitos:
1. Pro-B tempranos.
2. B maduros.
3. Pro-B tardíos.
4. Pre-B.
5. B inmaduros.

Respuesta correcta: 2. B maduros.